Clinical trial inclusion criterion:
Hemoglobin greater than or equal to 7.5 g/dL

Entity relations:
- Has_value("Hemoglobin", "greater than or equal to 7.5 g/dL")